Minimum posterior disc height of 5mm at the index level(s).

The above is a clinical trial inclusion criterion. Annotated with entity spans:
[Value: Minimum] [Measurement: posterior disc height] of 5mm at the [Qualifier: index level(s)].